Severe respiratory, digestive, hematological disease (including Anemia of Hb < 100 gram per litre) or tumor.

The above is a clinical trial exclusion criterion. Annotated with entity spans:
[Qualifier: Severe] [Condition: respiratory], [Condition: digestive], [Condition: hematological disease] (including [Condition: Anemia] of [Measurement: Hb] [Value: < 100 gram per litre]) or [Condition: tumor].